有關診斷、治療嚴重腦外傷病患之敘述，下列何者錯誤？
A. 必須先評估及治療傷患可能發生的休克、缺氧、凝血功能異常
B. 挫傷性腦出血可能在撞擊後馬上出現，但血塊有可能變大，特別是在 12 至 24 小時
C. 血塊或腦挫傷若大於 30 c.c.，一般認為可以造成顯著的質塊效應（mass effect），而造成神經學惡化以及進行性的腦損傷
D. 急性硬腦膜下出血（acute subdural hematoma）常是因中腦膜動脈（middle meningeal artery）的分支出血所引起

正確答案：D. 急性硬腦膜下出血（acute subdural hematoma）常是因中腦膜動脈（middle meningeal artery）的分支出血所引起